Clinical trial inclusion criteria:
Symptomatic patients with heart failure (men and women) aged >18 years,
Functional class II, III or IV by the New York Heart Association (NYHA)
Left ventricular ejection fraction <35%
Ischemic and nonischemic etiology
Type B natriuretic peptide (BNP) >150 pg/ml (or pro-BNP [N-terminal-proBNP] = 600 pg / ml) or if the patient was hospitalized for cardiac decompensation within the preceding 12 months, BNP >100 pg/ml (or N-terminal-proBNP = 400 pg / ml)

Annotated entities:
- Condition: "heart failure"
- Person: "men"
- Person: "women"
- Person: "aged"
- Value: ">18 years"
- Condition: "Symptomatic"
- Measurement: "New York Heart Association (NYHA)"
- Value: "Functional class II, III or IV"
- Measurement: "Left ventricular ejection fraction"
- Value: "<35%"
- Condition: "Ischemic etiology"
- Condition: "nonischemic etiology"
- Measurement: "Type B natriuretic peptide (BNP)"
- Value: ">150 pg/ml"
- Measurement: "pro-BNP [N-terminal-proBNP]"
- Value: "= 600 pg / ml"
- Procedure: "hospitalized"
- Condition: "cardiac decompensation"
- Temporal: "within the preceding 12 months"
- Measurement: "BNP"
- Value: ">100 pg/ml"
- Measurement: "N-terminal-proBNP"
- Value: "= 400 pg / ml"